Clinical trial exclusion criterion:
Peripheral neuropathy> 1 grade

Entity relations:
- Has_qualifier("Peripheral neuropathy", "> 1 grade")